Las alucinaciones son manifestaciones clínicas de la esquizofrenia que:
1. Ocurren sin estimulación externa del órgano sensorial implicado.
2. Se incluyen dentro de los síntomas negativos de la enfermedad.
3. Se caracterizan por el engrandecimiento de uno mismo de forma no realista.
4. Precisan tener en cuenta el contexto cultural de la persona.
5. Se asocian a los Síntomas Neurológicos Menores (SNM).

Respuesta correcta: 1. Ocurren sin estimulación externa del órgano sensorial implicado.